hemoglobin ≥ 9 g/dl or 5.59 mmol/l

The above is a clinical trial inclusion criterion. Annotated with entity spans:
[Measurement: hemoglobin] [Value: ≥ 9 g/dl] or 5.59 mmol/l